摘除下頜下腺（submandibular gland）時容易傷害走在下頜下腺導管下方的構造是：
A. 舌下神經（hypoglossal nerve）
B. 舌神經（lingual nerve）
C. 下齒槽神經（inferior alveolar nerve）
D. 鼓索神經（chorda tympani）

正確答案：B. 舌神經（lingual nerve）